Chronic gastrointestinal system disorders

The above is a clinical trial exclusion criterion. Annotated with entity spans:
[Condition: Chronic gastrointestinal system disorders]